Clinical trial exclusion criterion:
Previous uterine surgery.

Annotated entities:
- Procedure: "uterine surgery"